Clinical trial inclusion criteria:
breast cancer
undergoing unilateral mastectomy with or without axillary node dissection
received adequate oral and written information about the study and signed an informed-consent form

Annotated entities:
- Condition: "breast cancer"
- Measurement: "unilateral mastectomy"
- Temporal: "undergoing"
- Procedure: "axillary node dissection"
- Informed_consent: "received adequate oral and written information about the study and signed an informed-consent form"